What is GeneWeaver used for?

GeneWeaver is a freely available resource for storing, curating and analyzing sets of genes from heterogeneous data sources. GeneWeaver enables researchers to store, share, analyze, and compare results of their own genome-wide functional genomics experiments in an environment containing rich companion data obtained from major curated repositories, including the Mouse Genome Database and other model organism databases, along with derived data from highly specialized resources, publications, and user submissions.